假如一個人口有 10% 的人有某特定疾病，若從此人口隨機抽取出一個人，此人有此特定疾病的勝算是多少？
A. 1/10
B. 1/9
C. 10
D. 9

正確答案：B. 1/9